Clinical trial exclusion criterion:
oral steroids (topical and inhaled steroids are acceptable)

Annotated entities:
- Drug: "oral steroids"
- Drug: "inhaled steroids"
- Drug: "topical steroids"
- Negation: "acceptable"